下列那個部位的水晶體由較老的晶體纖維（older lens fibers）堆積形成？
A. 小帶纖維（zonular fiber）
B. 水晶體皮質（cortex）
C. 水晶體核（nucleus）
D. 晶囊（lens capsule）

正確答案：C. 水晶體核（nucleus）